下列那一項敘述與腫瘤細胞逃避免疫系統監測無關？
A. 抗體導致腫瘤細胞表面抗原的內吞（endocytosis）作用
B. 腫瘤細胞促進調節性T細胞（regulatory T cells）的浸潤
C. 腫瘤細胞分泌TGF-β細胞激素
D. 腫瘤細胞會活化抗原呈現細胞（antigen-presenting cell），並促進其co-stimulatory signals 的大量表現

正確答案：D. 腫瘤細胞會活化抗原呈現細胞（antigen-presenting cell），並促進其co-stimulatory signals 的大量表現